Use of statins and quinolones in the previous year;

The above is a clinical trial exclusion criterion. Annotated with entity spans:
Use of [Drug: statins] and [Drug: quinolones] [Temporal: in the previous year];